Approximately how many genes are contained in the X chromosome's non-pseudoautosomal region (non-PAR)?

Six of 783 non-pseudoautosomal region (PAR) X-chromosome genes harbored loss-of-function mutations more frequently in males.